Clinical trial exclusion criterion:
Severe Dehydration

Entity relations:
- Has_qualifier("Dehydration", "Severe")